Clinical trial exclusion criterion:
any other pelvic pathology causing pain

Entity relations:
- Has_qualifier("pelvic pathology", "causing pain")